下列那一種荷爾蒙沒有明顯的產熱作用（calorigenic action）？
A. 三碘甲狀腺素（T3）
B. 甲狀腺素（T4）
C. 助孕酮（progesterone）
D. 逆三碘甲狀腺素（reverse T3, RT3）

正確答案：D. 逆三碘甲狀腺素（reverse T3, RT3）